What is the role of CD28 with respect to bacterial superantigen toxins?

CD28 is a direct receptor of bacterial superantigen toxins.